Clinical trial exclusion criterion:
small bowel resection

Annotated entities:
- Procedure: "small bowel resection"